Clinical trial exclusion criterion:
older than 80 years

Entity relations:
- Has_value("years", "older than 80")